卵巢癌病人減積手術後，病理報告腹水檢查為陽性，肝臟表面、大網膜及骨盆淋巴腺皆有轉移，則此病人的 FIGO（International Federation of Gynecology & Obstetrics）分期為何？
A. ⅢA
B. ⅢB
C. ⅢC
D. Ⅳ

正確答案：C. ⅢC